下列關於唾液腺（salivary gland）之敘述，何項錯誤？
A. 腮腺/耳下腺（Parotid gland）由分泌黏液的細胞組成
B. 下頜下腺（Submandibular gland）分泌漿液為主
C. 舌下腺（Sublingual gland）分泌唾液的量比其它腺體少
D. 唇內、臉頰內及腭部均可找到小型唾液腺

正確答案：A. 腮腺/耳下腺（Parotid gland）由分泌黏液的細胞組成